Use of acetylsalicylic acid (ASA), antiplatelet agents within 7 days prior to surgery

The above is a clinical trial exclusion criterion. Annotated with entity spans:
Use of [Drug: acetylsalicylic acid] ([Drug: ASA]), [Drug: antiplatelet agents] [Temporal: within 7 days prior to surgery]